Clinical trial exclusion criterion:
Insufficient response to pregabalin in the treatment of partial seizure, or patients currently receiving pregabalin treatment.

Entity relations:
- AND("Insufficient response", "pregabalin")
- AND("pregabalin", "partial seizure")
- OR("Insufficient response", "pregabalin")